Clinical trial exclusion criterion:
positive drug screen or alcohol breathalyzer

Entity relations:
- Has_value("drug screen", "positive")
- OR("drug screen", "alcohol breathalyzer")